Clinical trial inclusion criterion:
Hemoglobin > or = to 11.5g/dL

Annotated entities:
- Measurement: "Hemoglobin"
- Value: "> or = to 11.5g/dL"